Clinical trial exclusion criterion:
Unstable vital sign before surgery

Annotated entities:
- Qualifier: "Unstable"
- Condition: "vital sign"
- Temporal: "before surgery"
- Procedure: "surgery"
- Reference_point: "surgery"